Gastrointestinal bleeding in the previous 3 months.

The above is a clinical trial exclusion criterion. Annotated with entity spans:
[Condition: Gastrointestinal bleeding] [Temporal: in the previous 3 months].